Clinical trial exclusion criterion:
Receiving warfarin or other oral anticoagulant

Entity relations:
- Has_qualifier("oral anticoagulant", "other")
- OR("warfarin", "oral anticoagulant")